No light perception in the affected eye

The above is a clinical trial exclusion criterion. Annotated with entity spans:
[Negation: No] [Condition: light perception] in the affected eye